下列何者可以有效治療土壤絲菌病（nocardiosis），且與 pyrimethamine 合併可用來治療愛滋病人對抗 Pneumocystis jirovecii（舊名：Pneumocystis carinii）的感染？
A. Clindamycin
B. Norfloxacin
C. Trimethoprim
D. Sulfadiazine

正確答案：D. Sulfadiazine